2. Diagnosis of acute promyelocytic leukemia

The above is a clinical trial exclusion criterion. Annotated with entity spans:
2. Diagnosis of [Condition: acute promyelocytic leukemia]